2. Active infection with EBV, CMV, and/or Adenovirus, unable to be successfully controlled with standard therapy.

The above is a clinical trial inclusion criterion. Annotated with entity spans:
[Parsing_Error: 2.] Active infection with [Condition: EBV], [Condition: CMV], and/or [Condition: Adenovirus], [Qualifier: unable to be] successfully controlled with [Procedure: standard therapy].